一位 48 歲末期腎衰竭男性病患接受透析（dialysis）治療登記腎臟移植，此病患曾經有泌尿系統方面的問題（腎結石以及血尿），下列何種檢查宜避免？
A. 接受使用 gadolinium 作核磁共振造影檢查
B. 接受靜脈注射顯影劑做電腦斷層檢查
C. 安排腎臟與膀胱超音波檢查
D. 安排膀胱鏡或逆行性腎輸尿管攝影

正確答案：A. 接受使用 gadolinium 作核磁共振造影檢查